¿Qué tipo de imagen aparece cuando el individuo no fija su atención en ella y, por el contrario, desaparece cuando se concentra en la experiencia?
1. Imágenes consecutivas.
2. Imágenes mnémicas.
3. Imágenes alucinoides.
4. Imágenes anómalas.
5. Imágenes parásitas.

Respuesta correcta: 5. Imágenes parásitas.